En torno al año y medio de edad, durante el período sensoriomotor, el niño se entrega a “experimentos” para descubrir nuevas propiedades de los objetos (tira las cosas para observar el movimiento de caída, por ejemplo). A este tipo de conductas repetidas se les denomina:
1. Esquemas de segundo orden.
2. Estructuras circulares de experimentación.
3. Reacciones circulares secundarias.
4. Reacciones circulares terciarias.
5. Esquemas de acción.

Respuesta correcta: 4. Reacciones circulares terciarias.